What is TSA-Seq used for?

TSA-Seq is a new mapping method capable of providing a "cytological ruler" for estimating mean mean distance distances from nuclear speckles genome-wide and for predicting several MbP chromosome trajectories between nuclear compartments.